下列關於尋常性魚鱗癬（ichthyosis vulgaris）的敘述，何者錯誤？
A. 可能會在異位性皮膚炎（atopic dermatitis）的病人身上發現
B. 病人手掌和腳掌的掌紋明顯（hyperlinearity）
C. 常會合併毛孔角化症（keratosis pilaris）
D. 通常有 filaggrin 及 profilaggrin 的增加

正確答案：D. 通常有 filaggrin 及 profilaggrin 的增加